Clinical trial inclusion criterion:
ALT and AST <2.5 × ULN; liver metastases, if any, the ALT and AST<5 × ULN

Entity relations:
- Has_value("AST", "<2.5 × ULN")
- Has_value("ALT", "<2.5 × ULN")
- Has_value("ALT", "<5 × ULN")
- AND("liver metastases", "ALT")
- Has_value("AST", "<5 × ULN")
- AND("liver metastases", "AST")